Clinical trial inclusion criteria:
Participants having H. pylori related chronic gastritis with/without peptic ulcers who are aged greater than 20 years old and are willing to received eradication therapy.

Annotated entities:
- Qualifier: "H. pylori related"
- Condition: "chronic gastritis"
- Condition: "peptic ulcers"
- Person: "aged"
- Value: "greater than 20 years old"
- Mood: "willing to received"
- Procedure: "eradication therapy"